關於 aminoacyl-tRNA 的合成反應，下列那一項敘述正確？
A. 需要鳥苷三磷酸（GTP）與錳離子（Mn2+）
B. 需要腺苷三磷酸（ATP）與錳離子（Mn2+）
C. 將胺基酸接合在 tRNA 的 5'端
D. 由 aminoacyl-tRNA synthetase 催化產生

正確答案：D. 由 aminoacyl-tRNA synthetase 催化產生